Clinical trial inclusion criteria:
Women be at least 18 years of age
Have symptoms of vaginal odor and or/discharge
Meet the clinical (Amsel) criteria for BV
Willing to participate in research

Annotated entities:
- Person: "Women"
- Value: "at least 18 years"
- Person: "age"
- Mood: "symptoms of"
- Condition: "vaginal odor"
- Condition: "vaginal discharge"
- Condition: "BV"
- Qualifier: "criteria clinical"
- Qualifier: "Amsel criteria"
- Observation: "participate in research"
- Mood: "Willing to"